朱先生是末期肝癌患者，目前陷入深度昏迷。因病人已是末期病患，在臨終前不宜再施行心肺復甦術。醫師欲向家屬作出不施行心肺復甦術建議。根據我國法律，下列相關之敘述何者正確？
A. 在親屬中能簽署同意不施行心肺復甦術者具最優先權的是配偶
B. 必須有 3 名具相關專科醫師資格之醫師判斷朱先生是末期病患
C. 必須有 2 名以上之成年家屬簽署同意書
D. 不施行心肺復甦術同意書應訂定有效期限，若超過期限便失效

正確答案：A. 在親屬中能簽署同意不施行心肺復甦術者具最優先權的是配偶